¿Cuál de las siguientes cifras de albúmina en orina se define como microalbuminuria?
1. Menos de 30 mg en 24 horas.
2. Menos de 300 mg en 24 horas.
3. Entre 30 y 300 mg/g de creatinina.
4. Entre 300 y 1000 mg/g de creatinina.

Respuesta correcta: 3. Entre 30 y 300 mg/g de creatinina.